Clinical trial inclusion criterion:
Life expectancy >/= 4 months for maintenance cohorts and >/= 6 months for adjuvant cohorts

Entity relations:
- Has_value("adjuvant cohorts", ">/= 6 months")
- Has_value("maintenance cohorts", ">/= 4 months")
- Has_context("Life expectancy", "maintenance cohorts")
- OR("maintenance cohorts", "adjuvant cohorts")